一位媽媽帶著她 6 個月大的男嬰來到兒科急診，主訴這位小嬰兒自從出生後，已有 10 次中耳炎發作及 2 次因肺炎住院的過去病史，理學檢查時發現這嬰兒身上有多處瘀青（bruises），四肢也有多處濕疹（eczema），您認為這位小男嬰可能的診斷是：
A. Ataxia-telangiectasia
B. Wiskott-Aldrich syndrome
C. X-linked agammaglobulinemia
D. Combined variable immunodeficiency

正確答案：B. Wiskott-Aldrich syndrome